Clinical trial exclusion criterion:
Injuries to or operations on the central nervous system, eyes and ears within the last 2 months.

Annotated entities:
- Procedure: "operations"
- Condition: "Injuries"
- Qualifier: "central nervous system"
- Qualifier: "eyes"
- Qualifier: "ears"
- Temporal: "last 2 months"